退伍軍人菌（Legionella）肺炎若有適當痰液可供革蘭氏染色，則最不易有下列何種發現？
A. 每低倍鏡視野WBC多於25
B. 每低倍鏡視野上皮細胞少於10
C. 痰中細菌極少
D. 痰中易看到細長之革蘭氏陰性桿菌

正確答案：D. 痰中易看到細長之革蘭氏陰性桿菌